下列何種病毒經乙醚（ether）處理後會喪失感染活性？
A. hepatitis A virus
B. influenza virus
C. rotavirus
D. poliovirus

正確答案：B. influenza virus